Los ácidos teicoicos:
1. Se encuentran en la membrana externa de las bacterias Gram negativas.
2. Son polímeros de glicerol o ribitol unidos por grupos P.
3. Están constituidos por unidades repetitivas de glucosa y galactosa unidas por enlaces beta (1-4).
4. Tienen carga positiva.

Respuesta correcta: 2. Son polímeros de glicerol o ribitol unidos por grupos P.